An initial plasma sodium concentration of higher than 150 mmol/L

The above is a clinical trial exclusion criterion. Annotated with entity spans:
An [Multiplier: initial] [Measurement: plasma sodium concentration] of [Value: higher than 150 mmol/L]